下列何種菌株的藥物敏感性試	結果，符合多重抗藥性結核病（multidrug-resistant tuberculosis）的定義？
A. isoniazid及streptomycin抗藥，但rifampin及ethambutol敏感
B. isoniazid, ethambutol及streptomycin抗藥，但rifampin敏感
C. isoniazid及rifampin抗藥，但ethambutol及streptomycin敏感
D. rifampin, ethambutol及streptomycin抗藥，但isoniazid敏感

正確答案：C. isoniazid及rifampin抗藥，但ethambutol及streptomycin敏感